Clinical trial inclusion criterion:
T-score according to DXA: <-2.5

Entity relations:
- multi("according to DXA", "DXA")
- Has_qualifier("T-score", "according to DXA")
- Has_value("T-score", "<-2.5")